Which protein is involved in the organization and regulation of pluripotency-associated three-dimensional enhancer networks?

KLF4 is involved in the organization and regulation of pluripotency-associated enhancer networks. How transcription factors orchestrate the complex molecular changes around their target gene loci remains incompletely understood.